Clinical trial inclusion criterion:
A male or female between, and including, 18 and 50 years of age at the time of the first study visit.

Annotated entities:
- Person: "male"
- Person: "female"
- Value: "18 and 50 years"
- Person: "age"
- Temporal: "at the time of the first study visit"
- Reference_point: "the first study visit"